Clinical trial exclusion criterion:
Family history of congenital or hereditary immunodeficiency.

Entity relations:
- Has_context("congenital immunodeficiency", "Family history")
- OR("congenital immunodeficiency", "hereditary immunodeficiency")